下列那一種免疫球蛋白能夠通過胎盤，提供新生兒對抗病原菌保護力？
A. IgA
B. IgE
C. IgG
D. IgM

正確答案：C. IgG